All subjects will speak English as their first language or demonstrate proficiency in English (defined as reaching a scaled score of > 11 on the WAIS vocabulary test).

The above is a clinical trial inclusion criterion. Annotated with entity spans:
All subjects will [Observation: speak English] as their [Qualifier: first language] or demonstrate [Observation: proficiency in English] (defined as reaching a scaled score of [Value: > 11] on the [Measurement: WAIS vocabulary test]).